Highly active RMS as defined by:

The above is a clinical trial inclusion criterion. Annotated with entity spans:
[Qualifier: Highly active] [Condition: RMS] [Non-representable: as defined by:]